Clinical trial exclusion criterion:
Male sterilization (at least 6 months prior to screening). For female subjects on the study the vasectomized male partner should be the sole partner for that subject.

Annotated entities:
- Procedure: "Male sterilization"
- Temporal: "at least 6 months prior to screening"
- Reference_point: "screening"
- Non-query-able: "For female subjects on the study the vasectomized male partner should be the sole partner for that subject"